Clinical trial exclusion criterion:
21. Transaminases (alanine transaminase, aspartate transaminase) levels >3 × upper limit of normal (ULN) and/or bilirubin level >2 × ULN.

Entity relations:
- Subsumes("Transaminases levels", "alanine transaminase")
- Has_value("Transaminases levels", ">3 × upper limit of normal (ULN)")
- Has_value("bilirubin level", ">2 × ULN")
- Subsumes("Transaminases levels", "aspartate transaminase")